Clinical trial inclusion criterion:
HCV treatment-naïve, as defined as no prior exposure to any Interferon (IFN), RBV, or other FDA approved or experimental HCV-specific direct-acting antiviral agent

Entity relations:
- Has_negation("treatment", "naïve")
- AND("treatment", "HCV")
- Has_temporal("Interferon (IFN)", "prior")
- Has_negation("Interferon (IFN)", "no")
- Subsumes("treatment", "Interferon (IFN)")
- OR("Interferon (IFN)", "RBV")